下列有關弓蟲（Toxoplasma gondii）之敘述，何者錯誤？
A. 免疫正常之成人後天感染弓蟲，絕大多數都沒有臨床症狀
B. 先天性感染以懷孕的第一個三個月（first trimester）時感染，先天性病變最嚴重
C. 其終宿主已經確定為人類
D. 主要在宿主之巨噬細胞（macrophages）內增生繁殖

正確答案：C. 其終宿主已經確定為人類